Congenital heart disease

The above is a clinical trial exclusion criterion. Annotated with entity spans:
[Condition: Congenital heart disease]